Clinical trial exclusion criterion:
Familial hypertriglyceridemia

Annotated entities:
- Condition: "Familial hypertriglyceridemi"